一名 6 歲大的女童主訴過去兩個月來有間歇性由肛門解出少量亮紅色的血便，但無腹痛發生。理學檢查並無肛裂，但肛門指診後，指套上有血，引起此病童直腸出血最可能的原因是：
A. 腸套疊
B. 青年性息肉
C. 美克爾氏憩室
D. 潰瘍性結腸炎

正確答案：B. 青年性息肉